Clinical trial inclusion criterion:
the patients undergoing ascending, arch and/or proximal descending aorta surgery with cardiopulmonary bypass

Annotated entities:
- Procedure: "ascending aorta surgery"
- Procedure: "arch aorta surgery"
- Procedure: "proximal descending aorta surgery"
- Procedure: "cardiopulmonary bypass"